Clinical trial exclusion criterion:
Have a diagnosis of schizophrenia or other major psychiatric diagnosis or mental illness (e.g. major depression)

Entity relations:
- Subsumes("mental illness", "major depression")
- OR("schizophrenia", "major psychiatric diagnosis", "mental illness")